Clinical trial exclusion criterion:
Severe concomitant disease with life expectation < 1 year

Entity relations:
- AND("Severe disease", "life expectation")
- Has_temporal("Severe disease", "concomitant")
- OR("life expectation", "< 1 year")